Clinical trial inclusion criterion:
significant symptomatic cardiac disease

Entity relations:
- Has_qualifier("cardiac disease", "significant")
- Has_qualifier("cardiac disease", "symptomatic")